Los instrumentos de evaluación para el screening (cribado) del desarrollo de los niños pretenden:
1. Proporcionar una medida de inteligencia global.
2. Evaluar las habilidades específicas.
3. Identificar a aquellos niños que tienen una alta probabilidad de padecer un desarrollo retrasado.
4. Diagnosticar a los niños con un desarrollo intelectual aventajado.

Respuesta correcta: 3. Identificar a aquellos niños que tienen una alta probabilidad de padecer un desarrollo retrasado.